下列有關脊髓後外側溝（posterolateral sulcus）的敘述，何者正確？
A. 僅存在於上胸段（upper thoracic level）以上
B. 為後根神經纖維（posterior root fibers）進入脊髓處
C. 將後側脊髓（dorsal spinal cord）分成左、右兩半
D. 為脊髓後角（posterior horn）與前角（anterior horn）分界處

正確答案：B. 為後根神經纖維（posterior root fibers）進入脊髓處